Clinical trial exclusion criterion:
Endometriosis III-IV stage or adenomyosis

Annotated entities:
- Condition: "Endometriosis"
- Qualifier: "III-IV stage"
- Condition: "adenomyosis"